admitted for living donor renal transplantation.

The above is a clinical trial inclusion criterion. Annotated with entity spans:
[Mood: admitted for] [Procedure: living donor renal transplantation].